En relación a las indicaciones de la Nutrición Enteral, según la capacidad gastrointestinal, seleccione la respuesta INCORRECTA:
1. Si la capacidad gastrointestinal está intacta la nutrición enteral no está indicada en pacientes comatosos o semiconscientes.
2. La nutrición enteral puede indicarse en pacientes con vaciado gástrico retrasado.
3. Cuando existen vómitos incoercibles la nutrición enteral no debe instaurarse.
4. La hemorragia digestiva crónica es una contraindicación relativa.

Respuesta correcta: 1. Si la capacidad gastrointestinal está intacta la nutrición enteral no está indicada en pacientes comatosos o semiconscientes.